Clinical trial inclusion criterion:
Free of psychoactive medication for at least: one month for fluoxetine; two weeks for other SSRIs and neuroleptics; and five days for stimulants prior to MRI scanning [excepting stable doses (greater than three months duration) of anticonvulsant medication for seizure disorder]

Entity relations:
- Has_negation("psychoactive medication", "Free of")
- AND("anticonvulsant medication", "seizure disorder")
- Has_temporal("stimulants", "at least five days")
- Subsumes("stable doses", "greater than three months")
- Has_temporal("fluoxetine", "prior to MRI scanning")
- AND("psychoactive medication", "fluoxetine")
- Has_qualifier("anticonvulsant medication", "stable doses")
- Has_temporal("fluoxetine", "at least one month")
- Has_temporal("SSRIs", "at least two weeks")
- Has_negation("anticonvulsant medication", "excepting")
- AND("psychoactive medication", "anticonvulsant medication")
- OR("SSRIs", "neuroleptics")
- OR("fluoxetine", "SSRIs", "stimulants")